Clinical trial exclusion criterion:
Prior treatment with more than 6 cycles of traditional alkylating agent-based chemotherapy regimens

Entity relations:
- Has_qualifier("chemotherapy regimens", "alkylating agent-based")
- AND("more than 6 cycles", "chemotherapy regimens")
- Subsumes("chemotherapy regimens", "treatment")
- Has_temporal("chemotherapy regimens", "Prior")